Clinical trial exclusion criterion:
Severe allergic reactions in anamnesis of autoimmune disease;

Annotated entities:
- Qualifier: "Severe"
- Condition: "allergic reactions"